Which proteins are controlling sterol metabolism in S. cerevisiae?

The yeast genome encodes seven oxysterol binding protein homologs, Osh1p-Osh7p, which have been implicated in regulating intracellular lipid and vesicular transport northern blot analysis showed that increased binding correlates with increased expression for the analyzed Upc2p targets ( ERG11, MDR1, CDR1, YOR1, SUT1, SMF12, and CBP1 ).Taken together, our results indicate that upc2p is a key regulator of ergosterol metabolism.Overrepresented functional groups of genes whose promoters were bound by upc2p included 12 genes involved in ergosterol biosynthesis ( ncp1, erg11, erg2, and others ) to better understand upc2p function in c. albicans, we used genomewide location profiling to identify the transcriptional targets of upc2p in vivo.Upc2p, a transcription factor of the zinc cluster family, is an important regulator of sterol biosynthesis and azole drug resistance in candida albicans sterol metabolism and erg2 gene regulation in the yeast saccharomyces cerevisiae.We have taken advantage of this property to study the regulation of the delta8-delta7-sterol isomerase-encoding erg2 gene expression.Ergosterol starvation leads to an 8-16-fold increase in ERG2 gene expression.